Clinical trial inclusion criterion:
Constant habitual activity patterns (no deviation > 1x/wk at 30 min/session within last 3 months)

Entity relations:
- Subsumes("Constant habitual activity patterns", "no deviation > 1x/wk at 30 min/session within last 3 months")